Clinical trial exclusion criterion:
has current oral lesions, canker sores, or piercings

Annotated entities:
- Temporal: "current"
- Condition: "oral lesions"
- Condition: "canker sores"
- Device: "piercings"